those presenting with swallowing problem

The above is a clinical trial exclusion criterion. Annotated with entity spans:
those presenting with [Condition: swallowing problem]